以超音波作深部熱療（diathermy）時，下列何者不是禁忌症？
A. 慢性膝關節炎
B. 心臟節律器附近筋膜炎
C. 女性月經期腹腔痙攣
D. 眼球周邊慢性組織炎

正確答案：A. 慢性膝關節炎